Clinical trial inclusion criterion:
Provide written informed consent prior to inclusion.

Annotated entities:
- Observation: "written informed consent"
- Temporal: "prior to inclusion"
- Reference_point: "inclusion"